mean blood pressure more than 60mmHg

The above is a clinical trial inclusion criterion. Annotated with entity spans:
[Measurement: mean blood pressure] [Value: more than 60mmHg]